Clinical trial inclusion criterion:
aged 18-65 years old.

Annotated entities:
- Person: "aged"
- Value: "18-65 years old"